Clinical trial inclusion criterion:
Adequate hepatic and renal function

Annotated entities:
- Condition: "Adequate renal function"
- Condition: "Adequate hepatic function"